Clinical trial inclusion criterion:
No change in active cardiac medications for 4 weeks prior to randomization

Annotated entities:
- Negation: "No"
- Qualifier: "change"
- Drug: "cardiac medications"
- Temporal: "for 4 weeks prior to randomization"
- Reference_point: "randomization"